Clinical trial exclusion criterion:
On treatment with a P2Y12 receptor antagonist (ticlopidine, clopidogrel, prasugrel, ticagrelor) in the prior 10 days

Entity relations:
- Subsumes("P2Y12 receptor antagonist", "ticlopidine")
- Has_temporal("P2Y12 receptor antagonist", "prior 10 days")
- OR("ticlopidine", "clopidogrel", "prasugrel", "ticagrelor")